Medical or psychological condition that would not permit completion of the trial or signing of informed consent

The above is a clinical trial exclusion criterion. Annotated with entity spans:
[Informed_consent: Medical or psychological condition that would not permit completion of the trial or signing of informed consent]